關於小兒麻痺病毒（poliovirus）的敘述，下列何者正確？
A. 其基因體是由雙股RNA所組成
B. 病毒	膜（envelope）上的醣蛋白質（glycoprotein）不容易產生突變
C. 病毒顆粒很穩定，可以透過下水道系統汙染水源造成感染
D. 沙克（Salk）減毒疫苗和沙賓（Sabin）死毒疫苗，常被用來預防其所引起的疾病

正確答案：C. 病毒顆粒很穩定，可以透過下水道系統汙染水源造成感染